Hombre de 76 años de edad que consulta por deterioro cognitivo, lentitud y torpeza de movimientos, de ocho meses de evolución. La familia refiere que el paciente presentaba alucinaciones visuales, por lo que su médico de Atención Primaria pautó dosis bajas de risperidona, con un importante empeoramiento del estado motor. A la vista de estos datos, ¿cuál es el diagnóstico más probable?
1. Enfermedad de Alzheimer.
2. Demencia por cuerpos de Lewy.
3. Demencia frontotemporal.
4. Demencia vascular.
5. Enfermedad de Creutzfeldt-Jakob esporádica.

Respuesta correcta: 2. Demencia por cuerpos de Lewy.